一位 63 歲的患者因漸進式右後腹痛，有 6 小時之久，逐漸有漲滿感，且冒冷汗，於是被送來急診室。血壓：70/40 mmHg，血液檢查 Hgb：7.0 g/dL，電腦斷層發現右後腹腔有大範圍的血腫，右腎臟變形不清楚。急診室醫師診斷為後腹腔出血性休克，緊急予以輸血，在電腦斷層上患者左側腎臟亦可發現有多個脂肪及軟組織腫瘤樣病灶。患者鼻部、鼻兩側之臉部有許多的細小結節樣病灶。請問以下診斷何者最佳？
A. von Hipple-Lindau syndrome
B. multiple sclerosis
C. tuberous sclerosis
D. von Recklinghausen's disease

正確答案：C. tuberous sclerosis